下列何者不是胎兒循環轉換為新生兒循環會發生的生理過程？
A. 動脈導管變成由左至右分流
B. 靜脈導管關閉
C. 卵圓孔變成由右至左分流
D. 臍動脈萎縮關閉

正確答案：C. 卵圓孔變成由右至左分流